Extraliver metastases

The above is a clinical trial exclusion criterion. Annotated with entity spans:
[Condition: Extraliver metastases]